Clinical trial exclusion criterion:
Patients allergic to lidocaine or adhesive

Annotated entities:
- Condition: "allergic"
- Drug: "lidocaine"
- Drug: "adhesive"